Clinical trial exclusion criterion:
Significant risk of suicidal and/or self-harm behaviors

Entity relations:
- Has_mood("suicidal behaviors", "risk of")
- OR("suicidal behaviors", "self-harm behaviors")